Clinical trial exclusion criterion:
current or past history of psychiatric disease, alcoholism or drug abuse, and other primary sleep disorders

Entity relations:
- OR("psychiatric disease", "alcoholism", "drug abuse", "primary sleep disorders")